Clinical trial inclusion criterion:
Subject has been diagnosed with symptomatic paroxysmal atrial fibrillation as defined above and at least two symptomatic episodes in the last six months prior to inclusion.

Entity relations:
- Has_qualifier("paroxysmal atrial fibrillation", "symptomatic")
- Has_index("last six months prior to inclusion", "inclusion")
- Has_qualifier("episodes", "symptomatic")
- Has_multiplier("episodes", "at least two")
- AND("paroxysmal atrial fibrillation", "episodes")